Clinical trial inclusion criterion:
American Society of Anesthesiologists Status 1 -3

Annotated entities:
- Measurement: "American Society of Anesthesiologists Status"
- Value: "1 -3"